Patients with infection with the known Human Immunodeficiency Virus (HIV).

The above is a clinical trial exclusion criterion. Annotated with entity spans:
Patients with infection with the known [Condition: Human Immunodeficiency Virus (HIV)].